Clinical trial exclusion criterion:
Traumatic vascular injuries or operative interventions (Surgical harvesting) involving arteries of the upper limb on the operative side.

Entity relations:
- Subsumes("operative interventions", "Surgical harvesting")
- Has_qualifier("Traumatic vascular injuries", "arteries of the upper limb on the operative side")
- OR("Traumatic vascular injuries", "operative interventions")